Inability or unwillingness to provide informed consent or abide by the requirements of the study.

The above is a clinical trial exclusion criterion. Annotated with entity spans:
[Post-eligibility: Inability or unwillingness to provide informed consent or abide by the requirements of the study.]